Approximately how many genes are contained in the X chromosome's non-pseudoautosomal region (non-PAR)?

There are 783 non-pseudoautosomal region (PAR) X-chromosome genes.